Able to read and understand Norwegian.

The above is a clinical trial inclusion criterion. Annotated with entity spans:
[Observation: Able to read and understand Norwegian].